一位病患腦部損傷後，對外界漠不關心（indifference），反應慢，呈現假性憂鬱症狀  （pseudo-depression），則其最可能病變位置為何？
A. 額葉（frontal lobe）
B. 顳葉（temporal lobe）
C. 頂葉（parietal lobe）
D. 枕葉（occipital lobe）

正確答案：A. 額葉（frontal lobe）